下列何者不會引起膀胱逼尿肌膨脹不良（poor detrusor distensibility）？
A. 前列腺良性肥大接受經尿道前列腺切除手術
B. 放射治療造成detrusor fibrosis而失去膨脹能力
C. 間質性膀胱炎（interstitial cystitis）
D. 直腸癌接受low anterior resection手術治療

正確答案：A. 前列腺良性肥大接受經尿道前列腺切除手術